History of obstructive urinary disorders and dysuria, prostatic hypertrophy, prostatitis, and other lower urinary tract obstructive disorders.

The above is a clinical trial exclusion criterion. Annotated with entity spans:
[Temporal: History] of [Condition: obstructive urinary disorders] and [Condition: dysuria], [Condition: prostatic hypertrophy], [Condition: prostatitis], and [Qualifier: other] [Condition: lower urinary tract obstructive disorders].